Clinical trial exclusion criterion:
Active positive Hepatitis B, C and HIV serologies

Entity relations:
- Has_value("Hepatitis B serologies", "positive")
- OR("Hepatitis B serologies", "Hepatitis C serologies", "HIV serologies")